Patients will be included if they are having an in-patient spinal fusion procedure, are 18 years or older, post and post-operative pain control plan includes opioid medications.

The above is a clinical trial inclusion criterion. Annotated with entity spans:
Patients will be included if they are having an [Visit: in-patient] [Procedure: spinal fusion procedure], are [Value: 18 years or older], post and [Temporal: post-operative] [Procedure: pain control plan] includes [Drug: opioid] medications.